下列何者不是臺灣全民健康保險籌措保費之原則？
A. 使用者付費
B. 公平性
C. 充足性
D. 效率性

正確答案：A. 使用者付費